有關大腸直腸癌的化學治療準則，下列敘述何者錯誤？
A. StageⅠ病人術後不需使用術後輔助性化療
B. 5-fluorouracil-based（5- FU）regimen被建議可用於stageⅡ併有poor prognostic indicator的病人
C. FOLFOX regimen可延長stageⅢ病患存活率
D. Stage Ⅳ病人RAS mutation對於Anti-EGFR治療有好處

正確答案：D. Stage Ⅳ病人RAS mutation對於Anti-EGFR治療有好處